8. Taking other drugs known to reduce the metabolism of minocycline and thus increase the probability of toxicity.

The above is a clinical trial exclusion criterion. Annotated with entity spans:
8. [Non-representable: Taking other drugs known to reduce the metabolism of minocycline and thus increase the probability of toxicity.]